Seriously-ill patients with hypotension/capillary leak/life threatening bleeding.

The above is a clinical trial exclusion criterion. Annotated with entity spans:
[Condition: Seriously-ill] patients with [Condition: hypotension]/[Condition: capillary leak]/[Qualifier: life threatening] [Condition: bleeding].